Clinical trial exclusion criterion:
concomitant disease which must be treated with antibiotics

Entity relations:
- Has_temporal("disease", "concomitant")
- AND("treated", "antibiotics")
- AND("disease", "treated")